Clinical trial exclusion criterion:
patients who have suffered a neurologic event (seizure, stroke) or who have baseline dementia, both of which could limit delirium assessment

Entity relations:
- Subsumes("neurologic event", "seizure")
- OR("seizure", "stroke")
- OR("neurologic event", "baseline dementia")